Which small molecules inhibit the c-Myc/Max dimerization?

The small molecules that inhibit c-Myc/Max dimerization are Mycro1, Mycro2, Mycro3, IIA6B17, celastrol, 10058-F4, 10074-G5, JY-3-094, KJ-Pyr-9, MYCi361 and MYCi975